下列那一症狀不能作為主動脈瓣閉鎖不全之惡化指標？
A. 出現 Austin-Flint murmur
B. 全程早期心舒期心雜音（early diastolic blowing murmur）強度增加
C. 第一音（S1）加強
D. 脈壓＞1/2 心縮血壓

正確答案：C. 第一音（S1）加強